¿Qué coenzima interviene en la síntesis de Óxido Nítrico (NO)?
1. NADH.
2. NADPH.
3. FAD.
4. CoA.
5. Tiamina.

Respuesta correcta: 2. NADPH.